Clinical trial exclusion criterion:
Known allergy or hypersensitivity to escitalopram or bupropion

Entity relations:
- Subsumes("allergy", "escitalopram")
- OR("escitalopram", "bupropion")
- OR("allergy", "hypersensitivity")